Clinical trial inclusion criterion:
Planned goal TSH suppression 0.1-0.5 mU/L for at least 18 weeks postoperatively

Entity relations:
- Has_index("at least 18 weeks postoperatively", "postoperatively")
- Has_value("TSH suppression", "0.1-0.5 mU/L")
- Has_temporal("TSH suppression", "at least 18 weeks postoperatively")